下列何者骨齡最接近實際年齡（chronological age）？
A. 體質性生長遲延（constitutional growth delay）
B. 家族性身材矮小（genetic short stature）
C. 生長激素缺乏（growth hormone deficiency）
D. 甲狀腺低能症（hypothyroidism）

正確答案：B. 家族性身材矮小（genetic short stature）